我國醫院、診所、生物科技研究所產生的感染性廢棄物的處理目前以何種方式為主？
A. 衛生掩埋
B. 微波消毒
C. 高壓滅菌
D. 焚化

正確答案：D. 焚化